Adult patients with T2DM who are indicated to receive liraglutide, not as first-line therapy, in addition to diet and exercise to improve glycemic control

The above is a clinical trial inclusion criterion. Annotated with entity spans:
[Person: Adult] patients with [Condition: T2DM] who are [Mood: indicated to receive] [Drug: liraglutide], [Negation: not] as [Qualifier: first-line therapy], [Non-representable: in addition to diet and exercise to improve glycemic control]